Severe hepatic impairment

The above is a clinical trial exclusion criterion. Annotated with entity spans:
[Qualifier: Severe] [Condition: hepatic impairment]